Clinical trial exclusion criterion:
Secondary causes of osteoarthritis;

Entity relations:
- AND("Secondary causes", "osteoarthritis")